Clinical trial exclusion criterion:
the child has temperature > 39.0◦C or a severe acute illness as defined by the examining nurse

Entity relations:
- Has_value("temperature", "> 39.0◦C")
- Has_qualifier("acute illness", "severe")
- Has_qualifier("acute illness", "as defined by the examining nurse")